雖然兒科病童少有心臟腫瘤（cardiac tumors） 的發生，但若出現時，常造成心律不整及心衰竭的症狀，下列何種心臟腫瘤最為常見？
A. 纖維瘤（fibroma）
B. 橫紋肌瘤（rhabdomyoma）
C. 黏液瘤 （myxoma）
D. 淋巴瘤（lymphoma）

正確答案：B. 橫紋肌瘤（rhabdomyoma）